Clinical trial inclusion criterion:
Ischemic and nonischemic etiology

Annotated entities:
- Condition: "Ischemic etiology"
- Condition: "nonischemic etiology"